Written consent must be provided prior to study entry.

The above is a clinical trial inclusion criterion. Annotated with entity spans:
[Informed_consent: Written consent must be provided prior to study entry.]